Clinical trial exclusion criteria:
use illicit drugs or relapse during the last trimester of pregnancy
positive drug screen at the time of delivery
allergies to any medications used in the study
taking prescribed gabapentin at the time of admission for CD
contraindications to neuraxial anesthesia or require general anesthesia for CD
designated ASA physical status 4 or above

Annotated entities:
- Drug: "illicit drugs"
- Condition: "relapse"
- Temporal: "during the last trimester of pregnancy"
- Reference_point: "the last trimester of pregnancy"
- Condition: "pregnancy"
- Qualifier: "last trimester"
- Measurement: "drug screen"
- Value: "positive"
- Temporal: "at the time of delivery"
- Reference_point: "the time of delivery"
- Procedure: "delivery"
- Condition: "allergies"
- Drug: "medications used in the study"
- Drug: "gabapentin"
- Qualifier: "prescribed"
- Temporal: "at the time of admission for CD"
- Reference_point: "admission for CD"
- Procedure: "admission"
- Procedure: "CD"
- Condition: "contraindications"
- Procedure: "neuraxial anesthesia"
- Mood: "require"
- Procedure: "general anesthesia"
- Procedure: "CD"
- Measurement: "ASA physical status"
- Value: "4 or above"